Clinical trial exclusion criterion:
Use of alternative therapies or natural products to treat postmenopausal symptoms in the four weeks prior to randomization.

Annotated entities:
- Procedure: "alternative therapies"
- Drug: "natural products"
- Condition: "postmenopausal symptoms"
- Temporal: "in the four weeks prior to randomization"